2. Females of child-bearing potential (FOCP) must have a negative serum beta human chorionic gonadotropin (HCG) pregnancy test.

The above is a clinical trial inclusion criterion. Annotated with entity spans:
2. [Person: Females] of [Condition: child-bearing potential] (FOCP) must have a [Value: negative] [Measurement: serum beta human chorionic gonadotropin (HCG) pregnancy test].